腎上腺皮質廣泛被破壞，可能出現下列何者？
A. 月亮臉
B. 皮膚著色過度
C. 高血壓
D. 多毛

正確答案：B. 皮膚著色過度